Las células de los túbulos seminíferos que sostienen y nutren a las células germinales son:
1. Las células de Leydig.
2. Las células de Sertoli.
3. Los espermatocitos primarios.
4. Los espermatocitos secundarios.
5. Las espermátidas.

Respuesta correcta: 2. Las células de Sertoli.